一位初產婦妊娠35週，發現血中泌乳激素為180 ng/mL，下列那項措施最適當？
A. 甲狀腺釋放激素（TRH）試
B. 胸部X光檢查
C. 血中雌激素檢查
D. 臨床上觀察追蹤

正確答案：D. 臨床上觀察追蹤